Clinical trial inclusion criterion:
Patients aged at least 18 years

Annotated entities:
- Person: "aged"
- Value: "at least 18 years"